Clinical trial exclusion criterion:
Inability to communicate in the preoperative period because of coma, profound dementia or language barrier;

Annotated entities:
- Condition: "coma"
- Condition: "dementia"
- Qualifier: "profound"
- Observation: "language barrier"
- Temporal: "preoperative period"
- Condition: "Inability to communicate"